一位 30 歲健康男性，在心室收縮末期，左心室仍約留有 42 c.c.的血液；在心室舒張末期，左心室亦留有約 140 c.c.的血液。其左心室射出分率（ejection fraction）為何？
A. 60%
B. 65%
C. 70%
D. 75%

正確答案：C. 70%